一個 39 歲糖尿病患，接受腎臟移植後，醫師選擇 Cyclosporin A 作為抗排斥藥，其主要機轉是抑制下列何者？
A. Macrophage function
B. Interleakin 1 production
C. Interleukin 2 production
D. Antibody production

正確答案：C. Interleukin 2 production